Clinical trial inclusion criterion:
Elective open abdominal hysterectomy with midline incision, age > 18 years, American Society of Anesthesiologist classification score (ASA classification) 1-3.

Annotated entities:
- Qualifier: "Elective"
- Procedure: "open abdominal hysterectomy"
- Qualifier: "midline incision"
- Person: "age"
- Value: "> 18 years"
- Measurement: "American Society of Anesthesiologist classification score"
- Measurement: "ASA classification"
- Value: "1-3"